Patients with a known congenital or acquired immunodeficiency.

The above is a clinical trial exclusion criterion. Annotated with entity spans:
Patients with a known [Qualifier: congenital] or [Qualifier: acquired] [Condition: immunodeficiency].